Clinical trial exclusion criterion:
Patients that do not have a valid Ontario Health Insurance Plan (OHIP) number at time of first transfusion

Annotated entities:
- Mood: "have a valid Ontario Health Insurance Plan (OHIP) number"
- Negation: "not"
- Temporal: "at time of first transfusion"
- Reference_point: "first transfusion"
- Procedure: "transfusion"
- Multiplier: "first"